Active positive Hepatitis B, C and HIV serologies

The above is a clinical trial exclusion criterion. Annotated with entity spans:
Active [Value: positive] [Measurement: Hepatitis B], C and [Measurement: HIV serologies]